Clinical trial inclusion criterion:
Primary ITP according to the definition of Rodeghiero et al. (52) and a platelet count of <30x109/l

Annotated entities:
- Condition: "Primary ITP"
- Measurement: "definition of Rodeghiero"
- Measurement: "platelet count"
- Value: "<30x109/l"